Clinical trial inclusion criterion:
chronic obstructive pulmonary disease (COPD), GOLD grade 2-3

Annotated entities:
- Condition: "chronic obstructive pulmonary disease"
- Condition: "COPD"
- Measurement: "GOLD grade"
- Value: "2-3"